5. ANC greater than 500/µL.

The above is a clinical trial inclusion criterion. Annotated with entity spans:
[Parsing_Error: 5.] [Measurement: ANC] [Value: greater than 500/µL].